Post menopausal women with a history of estrogen positive breast cancer who are receiving aromatase inhibitors for at least one month.

The above is a clinical trial inclusion criterion. Annotated with entity spans:
[Condition: Post menopausal] [Person: women] with a [Temporal: history] of [Qualifier: estrogen positive] [Condition: breast cancer] who are receiving [Drug: aromatase inhibitors] [Temporal: for at least one month].